Todo lo siguiente forma parte de los nucleósidos EXCEPTO:
1. Grupo fosfato.
2. Desoxirribosa.
3. Ribosa.
4. Pentosa.
5. Base púrica.

Respuesta correcta: 1. Grupo fosfato.